Clinical trial exclusion criterion:
No febrile illnesses with temperature >39 degree celsius for more than five consecutive days within the week preceding the Screening Visit.

Annotated entities:
- Condition: "febrile illnesses"
- Measurement: "temperature"
- Value: ">39 degree celsius"
- Temporal: "for more than five consecutive days"
- Temporal: "within the week preceding the Screening Visit"
- Reference_point: "the Screening Visit"
- Negation: "No"